Clinical trial exclusion criterion:
Confirmed allergy to apatinin and or its excipients;

Entity relations:
- AND("allergy", "apatinin")
- OR("apatinin", "excipients")